Clinical trial inclusion criteria:
Between the age of 25 to 65 at baseline
Be willing to participate in a smoking cessation program
Be willing to attend all clinic visits
Must be currently smoking at least ½ pack/day at baseline (confirmed with cotinine level and CO Smokerlyzer
>5 pack-year history of smoking
Global Initiative for Chronic Obstructive Lung Disease (GOLD) 0: FEV1=0.80 and FEV1/FVC>0.70 Forced Expiratory Volume in 1 second (FEV1), Forced Vital Capacity (FVC)
GOLD 1: FEV1=0.80 and FEV1/FVC < 0.70
GOLD 2: 0.50=FEV1<0.80 and FEV1/FVC < 0.70
Be willing to abstain from using any nicotine patches, e-cigarettes, or marijuana for the duration of the study.

Annotated entities:
- Value: "Between 25 to 65"
- Person: "age"
- Temporal: "at baseline"
- Mood: "willing to participate"
- Procedure: "smoking cessation program"
- Non-query-able: "Be willing to attend all clinic visits"
- Observation: "smoking"
- Value: "at least ½"
- Measurement: "pack/day"
- Temporal: "at baseline"
- Procedure: "cotinine level"
- Procedure: "CO Smokerlyzer"
- Measurement: "pack-year"
- Value: ">5"
- Observation: "smoking"
- Measurement: "Global Initiative for Chronic Obstructive Lung Disease (GOLD)"
- Value: "0"
- Measurement: "FEV1"
- Value: "=0.80"
- Measurement: "FEV1/FVC"
- Value: ">0.70"
- Non-representable: "Forced Expiratory Volume in 1 second (FEV1), Forced Vital Capacity (FVC)"
- Measurement: "GOLD"
- Value: "1"
- Measurement: "FEV1"
- Value: "=0.80"
- Measurement: "FEV1/FVC"
- Value: "< 0.70"
- Measurement: "GOLD"
- Value: "2"
- Measurement: "FEV1"
- Value: "0.50= <0.80"
- Measurement: "FEV1/FVC"
- Value: "< 0.70"
- Non-query-able: "Be willing to abstain from using any nicotine patches, e-cigarettes, or marijuana for the duration of the study."